Clinical trial exclusion criterion:
In the use of antibiotics and anti-inflammatories in the last three months;

Entity relations:
- Has_temporal("antibiotics", "in the last three months")
- OR("antibiotics", "anti-inflammatories")